¿Qué compuesto actúa como amortiguador de sulfhidrilos y como antioxidante?
1. Glucógeno.
2. Ácido glutámico.
3. Glucagón.
4. Glutation.
5. Ácido Ascórbico.

Respuesta correcta: 4. Glutation.